Expected simultaneous participation in any other clinical trial of an investigational medicinal product.

The above is a clinical trial exclusion criterion. Annotated with entity spans:
[Non-query-able: Expected simultaneous participation in any other clinical trial of an investigational medicinal product.]